Clinical trial exclusion criterion:
Has a transplanted organ (with the exception of a corneal transplant performed >= 3 months prior to baseline)

Entity relations:
- Has_temporal("corneal transplant", ">= 3 months prior to baseline")
- Has_negation("corneal transplant", "exception of")
- AND("transplanted organ", "corneal transplant")